Clinical trial exclusion criterion:
known brain damage

Annotated entities:
- Condition: "brain damage"